Clinical diagnosis of Autism Spectrum Disorder

The above is a clinical trial inclusion criterion. Annotated with entity spans:
[Qualifier: Clinical diagnosis] of [Condition: Autism Spectrum Disorder]